下列有關流行性感冒病毒的敘述，何者錯誤？
A. 基因含多段，因此重組現象普遍發生
B. 共分 A、B、C 三型
C. B 型常造成全世界大流行
D. 病毒感染後，續發性細菌感染（secondary bacterial infection），常引起肺炎

正確答案：C. B 型常造成全世界大流行